Clinical trial exclusion criterion:
Major surgery in the last 3 months prior to baseline or planned major surgery or cardiac intervention during the study.

Entity relations:
- Has_index("last 3 months prior to baseline or planned major surgery or cardiac intervention during the study", "baseline or planned major surgery or cardiac intervention during the stud")
- Has_temporal("Major surgery", "last 3 months prior to baseline or planned major surgery or cardiac intervention during the study")